Central venous oxygen saturation (ScvO2) < 60% despite optimization of hematocrit and volume status

The above is a clinical trial exclusion criterion. Annotated with entity spans:
[Measurement: Central venous oxygen saturation (ScvO2)] [Value: < 60%] [Observation: despite] [Procedure: optimization of hematocrit] and [Observation: volume status]